Clinical trial exclusion criterion:
Evidence of severe or uncontrolled systemic diseases, including active bleeding diatheses or active infections including hepatitis B, C and Human Immunodeficiency Virus (HIV)

Entity relations:
- Has_qualifier("systemic diseases", "severe")
- Subsumes("active infections", "hepatitis B")
- Subsumes("systemic diseases", "active bleeding diatheses")
- OR("severe", "uncontrolled")
- OR("hepatitis B", "Human Immunodeficiency Virus (HIV)", "hepatitis C")
- OR("active bleeding diatheses", "active infections")